Imagine que se encuentra en el supermercado con su vecina y observa que tiene un moratón en el ojo. ¿Qué heurístico estaría aplicando si sobreestima la posibilidad de que se deba a un problema de maltrato?
1. Representatividad.
2. Disponibilidad/ Accesibilidad.
3. Simulación.
4. Anclaje-Ajuste.
5. Falso consenso.

Respuesta correcta: 2. Disponibilidad/ Accesibilidad.